Clinical trial exclusion criterion:
Any other indication for dual antiplatelet therapy, i.e. recent stent implantation

Annotated entities:
- Condition: "dual antiplatelet therapy"
- Procedure: "stent implantation"
- Temporal: "recent"
- Condition: "indication"